關於非自主性的體重流失（involuntary weight loss）的敘述，下列何者錯誤？
A. 在6至12個月內，體重下降超過4.5公斤
B. 在6至12個月內，體重下降大於原先體重的5%
C. 甲狀腺功能亢進時，食慾減退是體重下降的主因
D. 慢性阻塞性肺病是其中一個原因

正確答案：C. 甲狀腺功能亢進時，食慾減退是體重下降的主因